下列何種過程最需要肺臟的參與？
A. 釋出血清素（serotonin）進入血液中
B. 活化舒緩激肽（bradykinin）
C. 將血纖維蛋白原（fibrinogen）轉變為血纖維蛋白（fibrin）
D. 將血管收縮素I（angiotension I）轉變為血管收縮素II（angiotension II）

正確答案：D. 將血管收縮素I（angiotension I）轉變為血管收縮素II（angiotension II）